Subject has a history of active malignancy: A patient with a history of any invasive malignancy (except non-melanoma skin cancer), unless he/she has been treated with curative intent and there have been no signs or symptoms of the malignancy for at least two (2) years.

The above is a clinical trial exclusion criterion. Annotated with entity spans:
Subject has a [Temporal: history] of [Condition: active malignancy]: A patient with a history of any [Qualifier: invasive] [Condition: malignancy] ([Negation: except] [Condition: non-melanoma skin cancer]), unless he/she has been [Condition: treated with curative intent] and there have been [Negation: no] [Condition: signs or symptoms of the malignancy] [Temporal: for at least two (2) years].